Clinical trial exclusion criterion:
Known severe peripheral vascular disease or major iliac arterial occlusive disease

Entity relations:
- Has_qualifier("peripheral vascular disease", "severe")
- Has_qualifier("iliac arterial occlusive disease", "major")
- OR("peripheral vascular disease", "iliac arterial occlusive disease")